Clinical trial exclusion criterion:
Prisoners (as defined by Office of Human Research Protection) at the time of enrollment ARE NOT ELIGIBLE for study entry. However, subjects who become prisoners after being enrolled will be included and not be withdrawn from the study. Patients on parole or probation are eligible for enrollment.

Entity relations:
- Has_qualifier("Prisoners", "Office of Human Research Protection")
- Has_index("at the time of enrollment", "the time of enrollment")
- Has_temporal("Prisoners", "at the time of enrollment")